在胸腺器官內，T 細胞發育到那一階段，就可以離開胸腺到達周邊淋巴器官？
A. 表現 CD3
B. T 細胞受器基因（T cell receptor genes）重組成功
C. 同時呈現 CD4 以及 CD8
D. 單獨呈現 CD4 或 CD8

正確答案：D. 單獨呈現 CD4 或 CD8